¿Cuál de los siguientes acontecimientos traumáticos tiene una mayor probabilidad de llevar a un Trastorno de Estrés Postraumático?:
1. Un terremoto.
2. Un accidente de tráfico.
3. Una agresión sexual.
4. Un accidente ferroviario con victimas múltiples.

Respuesta correcta: 3. Una agresión sexual.